14 歲男孩因半夜左側睪丸突然劇痛及紅腫而至急診室求診，否認有外傷或性接觸，理學檢查左側睪丸明顯腫大及壓痛，局部皮膚紅腫，BT：38.2℃，尿液檢查 WBC：10-12/HPF，RBC：0-1/HPF，此時疾病鑑別診斷最適當且最準確之方法為下列那一項？
A. 陰囊電腦斷層
B. 睪丸彩色杜卜勒超音波（Color Doppler sonography）
C. 提睪肌反射（cremasteric reflex）檢測
D. 陰囊核磁共振檢查

正確答案：B. 睪丸彩色杜卜勒超音波（Color Doppler sonography）